Clinical trial exclusion criterion:
Planning pregnancy within 2 years of study

Annotated entities:
- Mood: "Planning"
- Condition: "pregnancy"
- Temporal: "within 2 years of study"